Clinical trial inclusion criteria:
Osteoporosis

Annotated entities:
- Condition: "Osteoporosis"